Clinical trial inclusion criterion:
No more than 20 wk of gestation

Entity relations:
- Has_value("gestation", "No more than 20 wk")
- multi("gestation", "gestation")